Presence of positive test results for hepatitis B virus (HBV), hepatitis B surface antigen (HBsAg), or hepatitis C (HCV) antibody.

The above is a clinical trial exclusion criterion. Annotated with entity spans:
Presence of [Value: positive] test results for [Measurement: hepatitis B virus (HBV)], [Measurement: hepatitis B surface antigen (HBsAg)], or [Measurement: hepatitis C (HCV) antibody].